¿Cuál de las siguientes características es propia de Enterobius vermicularis?:
1. Huevos ovales, con la cubierta gruesa y aspecto mamelonado.
2. Esófago oxiuriforme y tres labios en torno a la boca.
3. Hembras con la cola corta y redondeada.
4. Machos sin espícula y con alas cefálicas muy grandes.

Respuesta correcta: 2. Esófago oxiuriforme y tres labios en torno a la boca.